Clinical trial exclusion criterion:
Concomitant interstitial lung disease, sarcoidosis, other significant lung disease.

Entity relations:
- Has_temporal("interstitial lung disease", "Concomitant")
- OR("interstitial lung disease", "lung disease", "sarcoidosis")